8. Evidence of significant airway and/or parenchymal lung disease.

The above is a clinical trial exclusion criterion. Annotated with entity spans:
[Parsing_Error: 8.] Evidence of [Qualifier: significant] [Condition: airway] and/or [Condition: parenchymal lung disease].